Clinical trial exclusion criterion:
Vaccination against pneumococcal infection in anamnesis;

Annotated entities:
- Condition: "pneumococcal infection"
- Procedure: "Vaccination"